Clinically significant illness during the 4 weeks prior to the first dose administration

The above is a clinical trial exclusion criterion. Annotated with entity spans:
[Subjective_judgement: Clinically significant illness during the 4 weeks prior to the first dose administration]